Requirement for treatment with both ACEIs and ARBs.

The above is a clinical trial exclusion criterion. Annotated with entity spans:
[Mood: Requirement for] [Procedure: treatment] with both [Drug: ACEIs] and [Drug: ARBs].